Clinical trial exclusion criterion:
Subjects with known seropositivity to human immunodeficiency virus.

Annotated entities:
- Measurement: "human immunodeficiency virus"
- Value: "seropositivity"